Para la obtención industrial del estaño se parte del mineral:
1. Cinabrio.
2. Blenda.
3. Wurtzita.
4. Casiterita.
5. Pirita.

Respuesta correcta: 4. Casiterita.